Clinical trial inclusion criterion:
AUDIT score of > or equal to 5, < or equal to 26

Annotated entities:
- Measurement: "AUDIT"
- Value: "score of > or equal to 5, < or equal to 26"